Clinical trial exclusion criterion:
Unable to communicate because of severe hearing loss or speech disorder

Annotated entities:
- Condition: "Unable to communicate"
- Condition: "severe hearing loss"
- Condition: "speech disorder"